Clinical trial inclusion criterion:
Patient has provided written informed consent.

Annotated entities:
- Informed_consent: "Patient has provided written informed consent"